Clinical trial inclusion criterion:
Affiliate or receiving a social security system.

Annotated entities:
- Non-query-able: "Affiliate or receiving a social security system"